Clinical trial exclusion criterion:
Inability to follow the protocol and comply with follow-up requirements or any other reason that the investigator feels would place the patient at increased risk;

Entity relations:
- OR("Inability to follow the protocol", "Inability to comply with follow-up requirements")